Sexually active (i.e. =1 attempt/week) males, 40 - 64 years of age (inclusive) at time of screening

The above is a clinical trial inclusion criterion. Annotated with entity spans:
[Observation: Sexually active] (i.e. [Multiplier: =1 attempt/week]) [Person: males], [Value: 40 - 64 years] of [Person: age] (inclusive) at time of screening